下列那一選項能夠增加統計檢定力（statistical power）？
A. 採用雙盲（double-blind）
B. 隨機分派（randomization）
C. 增加樣本數（sample size）
D. 使用對照組（control）

正確答案：C. 增加樣本數（sample size）